退化性關節炎（osteoarthritis）主要的致病機轉是：
A. 關節軟骨下之成骨細胞（subchondral osteocyte）因年紀累積之過度使用而損傷，引起該關節發炎反應
B. 關節滑液膜細胞（synoviocyte）退化，導致淋巴球浸潤該關節，引起發炎反應
C. 關節軟骨退化（articular cartilage degeneration）和軟骨細胞異常的修復能力（disordered repair of chondrocytes）
D. 關節滑液膜細胞（synoviocyte）損傷退化，導致synoviocyte因修復而過度增生，阻礙關節附近組織之血管通

正確答案：C. 關節軟骨退化（articular cartilage degeneration）和軟骨細胞異常的修復能力（disordered repair of chondrocytes）